下列何者的血液，不回流至內頸靜脈（internal jugular vein）？
A. 下岩竇（inferior petrosal sinus）
B. 面靜脈（facial vein）
C. 咽靜脈（pharyngeal vein）
D. 下甲狀腺靜脈（inferior thyroid vein）

正確答案：D. 下甲狀腺靜脈（inferior thyroid vein）